一名 52 歲性行為後陰道出血的女性，至門診求診，主訴從來沒有做過抹片，內診時發現子宮頸 12 點鐘方向有一潰瘍傷口易出血，下列何者為最恰當處置？
A. 做子宮頸抹片
B. 陰道荷爾蒙藥膏使用
C. 子宮頸組織切片
D. 子宮頸圓錐狀切除

正確答案：C. 子宮頸組織切片